Clinical trial exclusion criterion:
Failure to provide informed consent

Annotated entities:
- Non-query-able: "Failure to provide informed consent"